Clinical trial exclusion criterion:
a history of infection

Annotated entities:
- Temporal: "history"
- Condition: "infection"